Which is the receptor for the immunosuppressive drug cyclosporin A (CsA)?

Cyclophilin is the intracellular receptor protein for cyclosporin A  (CsA).